Clinical trial exclusion criterion:
• Disease-modifying anti-rheumatic drugs (30 days off drug)

Entity relations:
- Has_temporal("Disease-modifying anti-rheumatic drugs", "30 days off drug")